Clinical trial inclusion criterion:
Patients must not have received prior radiation therapy to the breast.

Entity relations:
- Has_negation("radiation therapy", "not")